使用全靜脈營養（TPN）之後產生膽汁鬱積（cholestasis），下列何者是最理想的治療方法？
A. 增加脂肪乳劑施打
B. 增加脂溶性維生素的補充量
C. 使用中鏈三酸	油酯（medium-chain triglyceride）的配方
D. 可能恢復腸道營養

正確答案：D. 可能恢復腸道營養